下列何者有實證（evidence-based）說明，病人在加護病房（intensive care units）中使用中央靜脈導管時可預防發生感染？①在sterile barrier precautions環境中放置 ②使用chlorhexidine solution做皮膚消毒 ③使用 antibiotic-impregnated中央靜脈導管 ④以超音波導引技術放置中央靜脈導管
A. ①②③
B. ②③④
C. ①③④
D. ①②④

正確答案：A. ①②③